Clinical trial exclusion criterion:
1. Renal insufficiency as an estimated GFR which is < 30 mL/min/1.7m2

Annotated entities:
- Parsing_Error: "1."
- Condition: "Renal insufficiency"
- Measurement: "estimated GFR"
- Value: "< 30 mL/min/1.7m2"